The informed consent has been obtained from the patient.

The above is a clinical trial inclusion criterion. Annotated with entity spans:
[Non-query-able: The informed consent has been obtained from the patient.]